下列關於視網膜胚細胞瘤（retinoblastoma）之敘述，何者錯誤？
A. 是小兒最常見的眼內原發惡性腫瘤
B. 最常出現的症狀為白色瞳孔（leukocoria）
C. 與致病相關之基因（RB1）位於染色體13q14位置
D. 治療選擇與腫瘤大小無關

正確答案：D. 治療選擇與腫瘤大小無關